1 to 17 years of age (before 18th birthday)

The above is a clinical trial inclusion criterion. Annotated with entity spans:
[Value: 1 to 17 years] of [Person: age] (before 18th birthday)